Clinical trial exclusion criterion:
prematurity (<37 weeks)/low birthweight <2500 g

Entity relations:
- Has_value("birthweight", "<2500 g")
- multi("low birthweight", "birthweight")
- OR("prematurity", "low birthweight")